Men must be completely contraception and prohibited donation and sperm donation during the treatment process and in 28 days after treatment;

The above is a clinical trial inclusion criterion. Annotated with entity spans:
[Person: Men] must be completely [Procedure: contraception] and [Negation: prohibited] [Procedure: donation] and [Procedure: sperm donation] [Temporal: during the treatment process] and [Temporal: in 28 days after treatment];